14 歲的小薇身材消瘦，因最近特別顯得病懨懨、並且抱怨口渴、頻尿、食慾變差及體重減輕而被媽媽帶到醫院檢查，經一系列實驗室檢驗後，醫師診斷她患有第一型糖尿病（type I diabetes mellitus）。第一型糖尿病是因為胰臟不能產生胰島素所致，治療必須每天注射多次的胰島素。下列關於胰島素訊息傳導機制之敘述，何者錯誤？
A. 胰島素與受體結合會引發受體蛋白之四級結構（quaternary structure）的變化
B. 胰島素與受體結合會活化一些 protein kinase
C. 胰島素受體為一 protein tyrosine kinase
D. 胰島素受體 protein kinase 的受質均為 transcription factor

正確答案：D. 胰島素受體 protein kinase 的受質均為 transcription factor